下列何者會經行於梨狀肌與尾骨肌之間？
A. 臀上動脈
B. 閉孔動脈
C. 膀胱下動脈
D. 陰部內動脈

正確答案：D. 陰部內動脈